Current substance/alcohol use disorder on structured interview (MINI Plus) Page 21 of 39 Commercial-in-Confidence

The above is a clinical trial inclusion criterion. Annotated with entity spans:
Current [Condition: substance]/[Condition: alcohol use disorder] on [Measurement: structured interview] ([Measurement: MINI Plus]) Page 21 of 39 Commercial-in-Confidence